Clinical trial inclusion criterion:
Coagulation disorder defined by PT less than 60%

Annotated entities:
- Condition: "Coagulation disorder"
- Measurement: "PT"
- Value: "less than 60%"